Clinical trial inclusion criterion:
Non-smokers (never smoked or not smoking for >6 months with <10 pack years history (Pack years = [cigarettes per day smoked/20] multiplied by number of years smoked).

Annotated entities:
- Observation: "Non-smokers"
- Observation: "never smoked"
- Observation: "not smoking"
- Temporal: "for >6 months"
- Value: "<10"
- Measurement: "pack years"
- Non-representable: "Pack years = [cigarettes per day smoked/20] multiplied by number of years smoked"